Clinical trial exclusion criterion:
Hypnotic medication prescribed or approved by the study physician, (up to a three doses per week) for insomnia, as long if not the night before a PET/MRI or clinic ratings visit. Antipsychotic medications, whether prescribed for sleep or other indications, are prohibited.

Annotated entities:
- Drug: "Hypnotic medication"
- Condition: "insomnia"
- Temporal: "the night before a PET/MRI or clinic ratings visit."
- Reference_point: "PET/MRI"
- Reference_point: "clinic ratings visit."
- Negation: "not"
- Drug: "Antipsychotic medications"